Clinical trial exclusion criterion:
Active uncontrolled infection

Entity relations:
- Has_qualifier("infection", "uncontrolled")
- Has_temporal("infection", "Active")